下列那一肌肉是由喉外神經（external laryngeal nerve）支配？
A. 後環杓肌（posterior cricoarytenoid muscle）
B. 外側環杓肌（lateral cricoarytenoid muscle）
C. 環甲肌（cricothyroid muscle）
D. 甲杓肌（thyroarytenoid muscle）

正確答案：C. 環甲肌（cricothyroid muscle）